Clinical trial inclusion criterion:
weigh more than 200 lbs

Entity relations:
- Has_value("weigh", "more than 200 lbs")